Clinical trial exclusion criterion:
administration of a vaccine during the period starting one month before the dose of vaccine and ending one month after

Annotated entities:
- Procedure: "vaccine"
- Temporal: "during the period starting one month before the dose of vaccine and ending one month after"
- Reference_point: "the dose of vaccine"
- Procedure: "vaccine"